HIV- uninfected women desiring PrEP

The above is a clinical trial inclusion criterion. Annotated with entity spans:
[Condition: HIV- uninfected] [Person: women] [Mood: desiring] [Procedure: PrEP]